下列那一種酵素參與克式循環（Krebs cycle，亦稱citric acid cycle或TCA cycle）的反應，是位於粒線體內膜上且直接參與電子傳遞鏈？
A. succinate dehydrogenase
B. isocitrate dehydrogenase
C. alpha-ketoglutarate dehydrogenase complex
D. malate dehydrogenase

正確答案：A. succinate dehydrogenase